Clinical trial inclusion criterion:
are high level ambulators corresponding to levels E to F of the Special Interest Group of Amputee Medicine (SIGAM) mobility grade

Entity relations:
- Has_value("Special Interest Group of Amputee Medicine (SIGAM) mobility grade", "levels E to F")
- AND("high level ambulators", "Special Interest Group of Amputee Medicine (SIGAM) mobility grade")